Clinical trial exclusion criterion:
Any concomitant cardiovascular procedure to CABG (i.e. valve, aortic or carotid surgery)

Annotated entities:
- Procedure: "cardiovascular procedure"
- Procedure: "CABG"
- Temporal: "concomitant"
- Procedure: "carotid surgery"
- Procedure: "aortic surgery"
- Procedure: "valve surgery"